Immunosuppression

The above is a clinical trial exclusion criterion. Annotated with entity spans:
[Condition: Immunosuppression]